Clinical trial exclusion criterion:
Serum aspartate transaminase > 3 times upper limit of normal

Annotated entities:
- Measurement: "Serum aspartate transaminase"
- Value: "> 3 times upper limit of normal"